Clinical trial exclusion criteria:
Ovarian cancer, adrenal gland tumor, endometrial cancer, cervical cancer, breast cancer
Congenital adrenal hyperplasia (17-OH-progesterone> 2.5 ng / mL)
Clinically diagnosed Cushing's disease, acromegaly, gigantism
Type I or II diabetes
Unexplained bleeding from the genital tract
Hormone treatment within the last 2 months

Annotated entities:
- Condition: "Ovarian cancer"
- Condition: "adrenal gland tumor"
- Condition: "endometrial cancer"
- Condition: "cervical cancer"
- Condition: "breast cancer"
- Condition: "Congenital adrenal hyperplasia"
- Measurement: "17-OH-progesterone"
- Value: "> 2.5 ng / mL"
- Qualifier: "Clinically diagnosed"
- Condition: "Cushing's disease"
- Condition: "acromegaly"
- Condition: "gigantism"
- Condition: "Type I diabetes"
- Condition: "Type II diabetes"
- Condition: "Unexplained bleeding"
- Qualifier: "genital tract"
- Procedure: "Hormone treatment"
- Drug: "Hormone"
- Temporal: "within the last 2 months"